Clinical trial exclusion criterion:
Insulin sensitizing treatment within 3 months prior to or during the eight week study period.

Annotated entities:
- Procedure: "Insulin sensitizing treatment"
- Temporal: "within 3 months prior to eight week study period"
- Temporal: "during the eight week study period"